Clinical trial exclusion criterion:
Subjects who donated >450 mL of blood within 60 days prior to any blood collection visits.

Annotated entities:
- Procedure: "donated blood"
- Value: ">450 mL"
- Temporal: "within 60 days prior to any blood collection visits"
- Reference_point: "any blood collection visits"